下列何者在小腿與腓深神經（deep peroneal nerve）伴行？
A. 腓動脈（peroneal artery）
B. 脛後動脈（posterior tibial artery）
C. 脛前動脈（anterior tibial artery）
D. 膕動脈（popliteal artery）

正確答案：C. 脛前動脈（anterior tibial artery）